Clinical trial exclusion criterion:
Invasively mechanically ventilated >72 hours at the time of screening;

Annotated entities:
- Procedure: "mechanically ventilated"
- Temporal: ">72 hours"